19-65 years of age

The above is a clinical trial inclusion criterion. Annotated with entity spans:
[Value: 19-65 years] of [Person: age]